Clinical trial inclusion criterion:
Medically fit for definitive surgical management of stone.

Annotated entities:
- Mood: "Medically fit for"
- Procedure: "definitive surgical management"
- Condition: "stone"